Clinical trial inclusion criterion:
No prior chemotherapy for their metastatic breast cancer (MBC).

Annotated entities:
- Procedure: "chemotherapy"
- Temporal: "prior"
- Negation: "No"
- Condition: "metastatic breast cancer (MBC)"